下列何種膀胱腫瘤的病理變化，為扁平病灶，可見惡性細胞散布於形態正常的尿道上皮細胞中，以帕哲氏病樣形式擴展（pagetoid spread）？
A. 原位癌（carcinoma in situ）
B. 低度惡性傾向性乳突狀尿道上皮腫瘤（papillary urothelial neoplasm of low malignant potential）
C. 低組織分級乳突狀尿道上皮癌（low-grade papillary urothelial carcinoma）
D. 高組織分級乳突狀尿道上皮癌（high-grade papillary urothelial carcinoma）

正確答案：A. 原位癌（carcinoma in situ）